下列何者最適合用於胃泌素瘤之鑑別診斷？
A. 高蛋白餐試驗（High protein meal test）
B. 鈣質灌流試驗（Calcium infusion test）
C. 基礎胃酸/最高胃酸比值
D. Secretin 激發試驗

正確答案：D. Secretin 激發試驗